24歲女性患者，因意識不清被送來急診處。在吸入室內空氣時，其動脈血液氣體分析顯示pH 7.12，PaCO2  mmHg，PaO2 45 mmHg，HCO3- 28 mEq/L，BE(ECF) 0 mEq/L。其低血氧症最可能之原因為何？
A. 急性氣喘發作
B. 慢性阻塞性肺疾併急性發作
C. 安眠藥中毒，換氣不足
D. 肺炎併呼吸衰竭

正確答案：C. 安眠藥中毒，換氣不足